Clinical trial exclusion criterion:
pregnant or lactating women

Entity relations:
- AND("women", "pregnant")
- OR("pregnant", "lactating")